Clinical trial inclusion criterion:
Moderate or severe claudication (Rutherford category 2 or 3)

Entity relations:
- Has_value("Rutherford category", "2 or 3")
- Subsumes("Moderate", "Rutherford category")
- Has_qualifier("claudication", "Moderate")
- OR("Moderate", "severe")